Clinical trial exclusion criterion:
Preoperative anticoagulation therapy

Entity relations:
- Has_temporal("anticoagulation therapy", "Preoperative")
- multi("anticoagulation therapy", "anticoagulation")